Contraindication to Aspirin

The above is a clinical trial exclusion criterion. Annotated with entity spans:
[Condition: Contraindication] to [Drug: Aspirin]